Clinical trial exclusion criterion:
latex allergy

Entity relations:
- AND("allergy", "latex")